Pregnancy or breast-feeding

The above is a clinical trial exclusion criterion. Annotated with entity spans:
[Condition: Pregnancy] or [Condition: breast-feeding]